Patients with a systemic or metabolic disorder leading to progressive bone deterioration

The above is a clinical trial exclusion criterion. Annotated with entity spans:
Patients with a [Condition: systemic] or [Condition: metabolic disorder] leading to [Qualifier: progressive] [Condition: bone deterioration]